Clinical trial exclusion criterion:
Pregnancy and lactation period.

Entity relations:
- AND("Pregnancy", "lactation period")